下列有關 Ebstein 氏異常（Ebstein's anomaly）之敘述，何者錯誤？
A. 主要病徵是三尖瓣向下移位至右心室的疾病
B. 最常見合併的異常為心室中隔缺損
C. 其他心臟的結構異常包括有：右心室、三尖瓣及傳導系統的異常
D. 常會有左右心房間的交通，而可能造成右向左分流

正確答案：B. 最常見合併的異常為心室中隔缺損